indication for osteoporosis therapy according to international guidelines

The above is a clinical trial inclusion criterion. Annotated with entity spans:
[Mood: indication for] [Procedure: osteoporosis therapy] according to [Qualifier: international guidelines]